Clinical trial exclusion criterion:
Patients with chronic immunosuppression (such as HIV/AIDS).

Annotated entities:
- Condition: "immunosuppression"
- Qualifier: "chronic"
- Condition: "HIV/AIDS"